Clinical trial exclusion criterion:
inflammatory arthritis including rheumatoid arthritis

Annotated entities:
- Condition: "inflammatory arthritis"
- Condition: "rheumatoid arthritis"